一名3個月大男嬰的血清中，苯丙胺酸（phenylalanine）與苯丙酮酸（phenylpyruvate）的濃度較高。若是苯酮尿症（phenylketonuria），最可能會再出現下列那個檢	數據？
A. 苯丙胺酸羥化酶（Phenylalanine hydroxylase）活性降低
B. 血清中的黑尿酸（Homogentisic acid）濃度偏高
C. 血清中的維生素B12濃度偏低
D. 血清中的維生素B6濃度偏低

正確答案：A. 苯丙胺酸羥化酶（Phenylalanine hydroxylase）活性降低